At Visit 1, receiving ongoing treatment with a duration of more than 2 weeks with prednisone equivalent to >10mg/day

The above is a clinical trial exclusion criterion. Annotated with entity spans:
[Temporal: At Visit 1], receiving ongoing treatment with a duration of more than 2 weeks with [Drug: prednisone] equivalent to [Multiplier: >10mg/day]